Clinical trial inclusion criterion:
Evidence of diastolic dysfunction showing E/E' > 10

Entity relations:
- Has_value("E/E'", "> 10")
- AND("diastolic dysfunction", "E/E'")